使用根蒂性橫腹直肌肌皮瓣（pedicled transverse rectus abdominis myocutaneous（TRAM）flap），下列敘述何者錯誤？
A. 血流供應來自深下腹動脈（deep inferior epigastric artery）
B. 任何大小與下垂的乳房都適合此重建方式
C. 抽菸和肥胖為相對禁忌症
D. 皮瓣血流僅來自單一血管根蒂時，zone IV 的血液循環最差

正確答案：A. 血流供應來自深下腹動脈（deep inferior epigastric artery）